下列何者為中性（neutral）物質的穿膜促進性擴散作用（facilitated diffusion）之特徵？
A. 這是一種需能反應
B. 主要依賴於膜電位（membrane potential）
C. 當代謝物濃度增加時，輸送速度會有上限
D. 以輸送速度與代謝物濃度作圖，將呈現線性圖

正確答案：C. 當代謝物濃度增加時，輸送速度會有上限